Clinical trial exclusion criterion:
Acute bacterial endocarditis

Annotated entities:
- Condition: "Acute bacterial endocarditis"